Clinical trial exclusion criterion:
MRI contraindications

Entity relations:
- AND("contraindications", "MRI")